¿Cuál de las siguientes afirmaciones sobre la enfermedad de Parkinson es verdadera?
1. La enfermedad comienza con manifestaciones evidentes que orientan al médico a formular el diagnóstico definitivo.
2. La enfermedad es un trastorno neurológico que se caracteriza por temblor, rigidez y bradicinesia.
3. En su inicio, los pacientes caminan cada vez más lentamente.
4. La flacidez, asociada a la disfunción motora, es bilateral.
5. En estadios avanzados, el paciente presenta lordosis.

Respuesta correcta: 2. La enfermedad es un trastorno neurológico que se caracteriza por temblor, rigidez y bradicinesia.